Current treatment with antiplatelet therapy

The above is a clinical trial exclusion criterion. Annotated with entity spans:
[Temporal: Current] treatment with [Procedure: antiplatelet therapy]